Clinical trial exclusion criteria:
Pregnancy at enrollment.
Any condition, which in the opinion of the provider, will seriously compromise the participant's ability to comply with the protocol, including adherence to PrEP medication dosing, such as active, untreated or unstable major mental illness (i.e. untreated psychotic disorder).
Use of prohibited medications, in particular, agents known to be nephrotoxic or drugs slow in renal excretion.
Previous participation in an HIV vaccine trial. Participants that were documented to have received only placebo are not excluded.
Signs or symptoms suspicious for Primary HIV Infection (PHI).

Annotated entities:
- Condition: "Pregnancy"
- Temporal: "at enrollment"
- Reference_point: "enrollment"
- Subjective_judgement: "Any condition, which in the opinion of the provider, will seriously compromise the participant's ability to comply with the protocol, including adherence to PrEP medication dosing, such as active, untreated or unstable major mental illness (i.e. untreated psychotic disorder)"
- Qualifier: "nephrotoxic"
- Procedure: "agents"
- Procedure: "drugs"
- Qualifier: "slow in renal excretion"
- Undefined_semantics: "Use of prohibited medications"
- Observation: "HIV vaccine trial"
- Person: "participation"
- Temporal: "Previous"
- Person: "Participants"
- Procedure: "placebo"
- Mood: "not"
- Condition: "Primary HIV Infection"
- Condition: "PHI"
- Condition: "symptoms"
- Condition: "Signs"